一位 45 歲女性病人主訴吞嚥困難，一年來症狀逐漸加深。病人同時有吸收不良的情形，六個月內體` 重減輕 5 公斤，並漸有呼吸不順。體溫 36.9℃、脈搏 66/min、呼吸 18/min、血壓 145/90 mmHg。超音波檢查顯示心包腔大量積水，ANA 測試為 1:512x 陽性、為核仁型。病人此種自體免疫反應疾病可能會發生下列何種嚴重併發症？
A. 腎盂腎炎
B. 十二指腸潰瘍穿孔
C. 腎上腺功能失能
D. 惡性高血壓

正確答案：D. 惡性高血壓